下列何種介白素（interleukin; IL）可同時影響多種細胞而表現最典型之內分泌作用？
A. IL-1
B. IL-2
C. IL-7
D. IL-12

正確答案：A. IL-1